Able to complete all testing required by the clinical protocol

The above is a clinical trial inclusion criterion. Annotated with entity spans:
[Post-eligibility: Able to complete all testing required by the clinical protocol]